正常新生兒，促甲狀腺素（thyroid-stimulating hormone, TSH）之敘述，下列何者錯誤？
A. 足月新生兒在出生30分鐘內， TSH最高可到達20 mIU/L
B. TSH在出生24小時後快速減少
C. TSH在出生後五天呈現＜10 mIU/L
D. 經過新生兒期（neonatal period）之後，TSH ＜6 mIU/L

正確答案：A. 足月新生兒在出生30分鐘內， TSH最高可到達20 mIU/L